9個月大的男嬰高燒5天，今天早上開始呈現嗜睡狀態，晚上因全身僵直陣攣性發作（Generalized tonic clonic  seizure）5分鐘被送來急診。在加護病房做了脊髓穿刺檢查，腦脊髓液報告顯示WBC 10000/µL（90% PMNs 和10% Lymphocyte），Protein 380 mg/dL，Glucose 5 mg/dL。下列何者為最可能的致病原？
A. 單純疱疹病毒第一型（HSV type 1）
B. 肺炎鏈球菌（Streptococcus pneumoniae）
C. 腸病毒（Enterovirus）
D. 新型隱球菌（Cryptococcus neoformans）

正確答案：B. 肺炎鏈球菌（Streptococcus pneumoniae）